3. Serious status of illness, such as severe renal failure whose creatinine clearance<30 ml/min, New York Heart Association grade III or grade IV congestive heart failure, or hemodynamic instability, etc.

The above is a clinical trial exclusion criterion. Annotated with entity spans:
[Parsing_Error: 3.] [Undefined_semantics: Serious status of illness], such as [Qualifier: severe] [Condition: renal failure] whose [Measurement: creatinine clearance][Value: <30 ml/min], [Measurement: New York Heart Association] [Value: grade III or grade IV] [Condition: congestive heart failure], or [Condition: hemodynamic instability], etc.